Clinical trial exclusion criterion:
with a history of mental illness and/or family history of mental illness limb disabled.

Entity relations:
- Has_temporal("mental illness", "history")
- Has_context("mental illness", "family history")
- Has_qualifier("mental illness", "limb disabled")
- Has_qualifier("mental illness", "limb disabled")
- OR("mental illness", "mental illness")